20歲男性，因下肢水腫住院，血清白蛋白是2.3 g/dL，血中尿素氮和血清肌酸酐各為27/1.2 mg/dL，24小時尿液蛋白質流失測得18 g。腎臟切片病理檢查，發現光學顯微鏡下腎絲球的結構正常。下列敘述何者正確？
A. 電子顯微鏡下應該看得到電子密集沈積
B. 通常血清補體是正常的
C. 如果治療有效，通常不會再發
D. 通常對類固醇治療的效果不佳，有效果的約只有30%

正確答案：B. 通常血清補體是正常的